Clinical trial inclusion criterion:
Age > 50 years

Annotated entities:
- Person: "Age"
- Value: "> 50 years"